Ongoing dementia treatment or anti-depressive disorder medication

The above is a clinical trial exclusion criterion. Annotated with entity spans:
[Temporal: Ongoing] [Condition: dementia] [Procedure: treatment] or [Drug: anti-depressive disorder medication]